胸部創傷為外傷病人常見的傷害，在初步評估（primary survey）時，要注意有無立即生命危險的胸部創傷（immediately life-threatening chest injuries），下列何種不是有立即生命危險的胸部傷害？
A. 張力性氣胸
B. 開放性氣胸
C. 橫膈破裂
D. 大量血胸（1500 mL 以上）

正確答案：C. 橫膈破裂